7. Signed informed consent

The above is a clinical trial inclusion criterion. Annotated with entity spans:
[Parsing_Error: 7.] [Post-eligibility: Signed informed consent]